who are judged by the investigator to should be excluded from the study

The above is a clinical trial exclusion criterion. Annotated with entity spans:
who are [Observation: judged by the investigator to should be excluded from the study]